一位 16 歲女孩，一年來逐漸出現雙頰反覆紅斑，日曬會惡化，淋巴腺腫，關節腫痛，跳舞會突然跌倒，腿部無力，身體檢查：血壓、心跳、呼吸、體溫均正常，手腳皮膚亮而緊，有雷諾氏現象（Raynaud phenomenon），血液相檢查結果為：WBC：3000/ L，Hb：11.0 g/dL，血小板 22,000/ L，血清生化檢查均正常；C3：56 mg/dL，C4：9.6 mg/dL，抗核抗體：1:2560（+），瀰漫型；24 小時尿蛋白：2.06 gm。 下列何種抗核抗體陽性對你的診斷最有幫助？
A. anti-nRNP 抗體
B. anti-ENA 抗體
C. \ anti-Histon 抗體
D. \ anti-cardiolipin 抗體

正確答案：A. anti-nRNP 抗體